Clinical trial inclusion criterion:
Age ≥ 18 years (Age ≥ 12 years for patients with bone sarcomas).

Annotated entities:
- Person: "Age"
- Value: "≥ 18 years"
- Person: "Age"
- Value: "≥ 12 years"
- Condition: "bone sarcomas"